En los estudios de metabolismo, el dextrometorfano es un fármaco considerado como sustrato prototipo de uno de los siguientes isoenzimas:
1. 2C8.
2. 2C9.
3. 2B6.
4. 2D6.

Respuesta correcta: 4. 2D6.